Clinical trial inclusion criterion:
3. Weight: At least 60 kg (132 lbs) for man and 48 kg (106 lbs) for women and within 15% of Ideal Body Weight (IBW), as referenced by the Table of ""Desirable Weights of Adults"" Metropolitan Life Insurance Company, 1999 (See Part II ADMINISTRATIVE ASPECTS OF BIOEQUIVALENCE PROTOCOLS).

Entity relations:
- Subsumes("At least 60 kg", "At least 132 lbs")
- Subsumes("At least 48 kg", "At least 106 lbs")
- Has_value("man", "At least 60 kg")
- Has_value("women", "At least 48 kg")
- AND("Weight", "man")
- Has_value("Weight", "within 15% of Ideal Body Weight (IBW)")
- OR("man", "women")